Clinical trial inclusion criterion:
Completion of screening visit where ovulation will be assessed with blood draw for progesterone level (must be 5ng/mL or greater)

Annotated entities:
- Measurement: "progesterone level"
- Value: "5ng/mL or greater"